Clinical trial exclusion criterion:
Patients on perioperative intravenous (IV) steroids.

Entity relations:
- Has_temporal("intravenous (IV) steroids", "perioperative")